Anatomical limitations preventing placement of an electrode

The above is a clinical trial exclusion criterion. Annotated with entity spans:
[Non-query-able: Anatomical limitations preventing placement of an electrode]